Clinical trial exclusion criterion:
Patients weighing more than 30 kg that would exceed maximum dexamethasone dose

Entity relations:
- Has_value("weighing", "more than 30 kg")